陳小姐因愛美而配戴隱形眼鏡多年，日前因眼睛刺痛、紅腫而求助於眼科醫師，經診斷罹患嚴重角膜炎 （keratitis），並於角膜刮取物抹片鏡檢時發現有角狀雙層壁囊體。依據上述結果，陳小姐最可能感染何種寄生蟲？
A. 大腸阿米巴（Entamoeba coli）
B. 痢疾阿米巴（Entamoeba histolytica）
C. 福氏內格里阿米巴（Naegleria fowleri）
D. 棘阿米巴（Acanthamoeba spp.）

正確答案：D. 棘阿米巴（Acanthamoeba spp.）